Dentro del campo de la bacteriología, ¿qué afirmación es válida en relación al fenómeno de conversión fágica?:
1. Es consecuencia de la infección por un fago lítico.
2. No implica alteraciones genotípicas.
3. Supone la lisogenización de la bacteria por un fago.
4. No implica alteraciones fenotípicas.
5. Es un proceso especializado de conjugación.

Respuesta correcta: 3. Supone la lisogenización de la bacteria por un fago.